Allergy to the used local anesthetics

The above is a clinical trial exclusion criterion. Annotated with entity spans:
[Condition: Allergy] to the used [Drug: local anesthetics]